Clinical trial exclusion criterion:
Treated with greater than 5 mg of prednisone (or equivalent) daily in the last 3 months

Entity relations:
- Has_multiplier("prednisone", "greater than 5 mg")
- Has_multiplier("prednisone", "daily")
- Has_temporal("prednisone", "in the last 3 months")